Clinical trial exclusion criterion:
Use of any of the following medications within two weeks of randomization: MAO inhibitors, Calcium channel blockers, alpha blockers, beta blockers, disopyramide, flecainide, encainide, moricizine, propafenone, sotalol, or beta adrenergic agonists

Entity relations:
- Has_temporal("MAO inhibitors", "within two weeks of randomization")
- OR("MAO inhibitors", "sotalol", "propafenone", "moricizine", "encainide", "flecainide", "disopyramide", "beta blockers", "alpha blockers", "Calcium channel blockers", "beta adrenergic agonists")